Clinical trial exclusion criterion:
Receiving drugs acting primarily on the central nervous system, which lower the seizure threshold such as antipsychotic drugs (chlorpromazine, clozapine) or tricyclic antidepressants.

Annotated entities:
- Drug: "drugs acting primarily on the central nervous system"
- Drug: "antipsychotic drugs"
- Qualifier: "lower the seizure threshold"
- Drug: "chlorpromazine"
- Drug: "clozapine"
- Drug: "tricyclic antidepressants"